尊重病人自主是醫學倫理的重要原則。何謂尊重病人自主？
A. 醫院建立標準作業流程，確保病人在手術前一定要親筆簽署手術同意書，就是尊重病人自主
B. 送到急診的頭部外傷病人，意識不清，在家屬沒有到院簽	前，絕對不可以進行手術，就是尊重自主
C. 只要送進加護病房的病人，一律發給家屬病危通知書，好讓家屬預先做好心理準備以及相關生活規劃，就是尊重自主
D. 以病人能了解的語言，主動告知病人相關病情資訊，確保病人理解醫療行為的相關風險與利益，協助病人做出一個符合其最佳利益的醫療決策，就是尊重自主

正確答案：D. 以病人能了解的語言，主動告知病人相關病情資訊，確保病人理解醫療行為的相關風險與利益，協助病人做出一個符合其最佳利益的醫療決策，就是尊重自主